下列何者為急性期中風病人最常發生的併發症？
A. 肺炎
B. 褥瘡
C. 靜脈栓塞
D. 癲癇發作

正確答案：A. 肺炎